下列有關Crohn's disease的敘述何者錯誤？
A. 病人體內對腸內共生菌有強烈發炎反應
B. 為第一型輔助性T細胞（TH1）主導的發炎疾病
C. 使用廣泛性抗生素可治療這種疾病
D. 可能與HLA-DQ2分子功能異常有關

正確答案：D. 可能與HLA-DQ2分子功能異常有關